NK cells 是人體對抗何種病原菌（pathogen）之早期防禦細胞？
A. 細菌（bacteria）
B. 真菌（fungi）
C. 病毒（viruses）
D. 原蟲（protozoa）

正確答案：C. 病毒（viruses）